下列有關寄生蟲逃避寄主免疫反應的機制之描述，那一項不正確？
A. 瘧疾原蟲（Plasmodium species）脫去 circumsporozoite（CS）抗原
B. 利什曼蟲（Leishmania species）引發寄主體內較高的 Th1 反應
C. 錐型蟲（Trypanosomes）外表有變異醣蛋白（variant surface glycoprotein）
D. 血吸蟲（Schistosomes）外表包覆著人類的 ABO 血型抗原

正確答案：B. 利什曼蟲（Leishmania species）引發寄主體內較高的 Th1 反應